significant medical or neurological conditions

The above is a clinical trial exclusion criterion. Annotated with entity spans:
[Post-eligibility: significant medical or neurological conditions]